Describe the role of epidermal CYLD inactivation in sebaceous and basaloid skin tumors

The deubiquitinase-encoding gene Cyld displays a dominant genetic linkage to a wide spectrum of skin-appendage tumors, which could be collectively designated as CYLD mutant-syndrome (CYLDm-syndrome). Despite recent advances, little is understood about the molecular mechanisms responsible for this painful and difficult-to-treat skin disease. Epidermal CYLD inactivation sensitizes mice to the development of sebaceous and basaloid skin tumors.